2. Subject underwent cardiac pacemaker treatment;

The above is a clinical trial exclusion criterion. Annotated with entity spans:
2. Subject underwent [Procedure: cardiac pacemaker treatment];